Clinical trial inclusion criteria:
18 years old or older.
ADHD is diagnosed according to Diagnostic and Statistical Manual of Mental Disorders, fifth edition (DSM-5 criteria).
Substance Use Disorder is diagnosed according to DSM-5 criteria.
Qb-score 1.3 or higher on at least one of the weighted summary parameters QbActivity, QbInattention or QbImpulsivity on the QbTest.
Participants are given their written informed consent to participate in the study.

Annotated entities:
- Person: "old"
- Value: "18 years or older"
- Condition: "ADHD"
- Qualifier: "DSM-5"
- Condition: "Substance Use Disorder"
- Qualifier: "DSM-5"
- Measurement: "Qb-score"
- Value: "1.3 or higher"
- Informed_consent: "Participants are given their written informed consent to participate in the study"